Clinical trial exclusion criterion:
Heparin therapy or oral anticoagulation therapy within 48 hours;

Annotated entities:
- Drug: "Heparin"
- Procedure: "therapy"
- Procedure: "oral anticoagulation therapy"
- Temporal: "within 48 hours"